¿Qué elementos podemos considerar para valorar el riesgo de exclusión social?:
1. Vivienda, trabajo, ingresos, relaciones sociales y derechos sociales/sanitarios.
2. Vivienda, trabajo, salud, relaciones personales y acceso al sistema de salud.
3. Trabajo, transporte, vivienda, idioma y etnicidad.
4. Vivienda, trabajo, ingresos, relaciones personales y salud.

Respuesta correcta: 1. Vivienda, trabajo, ingresos, relaciones sociales y derechos sociales/sanitarios.